小穎目前懷孕26週，沒有任何疾病家族史或重大疾病，體重90公斤，身高150公分，例行產檢時發現50克糖水測試（oral glucose challenge test）為151 mg/dL，經醫師建議下又做了一次三小時的100克糖水耐性測試（oral glucose tolerance test），結果分別是空腹105 mg/dL、1小時195 mg/dL、2小時170 mg/dL、3小時145 mg/dL。依此回答下列3題：下列敘述何者錯誤？
A. 根據第5次世界工作坊會議（fifth international workshop conference）的標準，小穎已符合妊娠糖尿病的診斷
B. 兩種測試（50g GCT and 100g OGTT）皆不需要空腹就可以執行
C. 妊娠糖尿病的產婦在生產後20年有超過一半的女性可能發展成糖尿病（overt DM ）
D. 妊娠糖尿病或母親體重過胖的胎兒死產率（unexplained stillbirth rate）都較一般孕婦為高

正確答案：B. 兩種測試（50g GCT and 100g OGTT）皆不需要空腹就可以執行